Clinical trial inclusion criterion:
Schirmer: > 4 mm and < 14 mm

Annotated entities:
- Measurement: "Schirmer"
- Value: "> 4 mm and < 14 mm"